Clinical trial exclusion criterion:
History of prostate, bladder, or rectal cancer

Entity relations:
- OR("prostate cancer", "bladder cancer", "rectal cancer")